一氧化碳擴散能力（DLCO），在下列何種情況下會有增加表現？
A. 鬱血性心臟衰竭
B. 間質性肺疾病
C. 肺氣腫
D. 肺血管高壓（pulmonary hypertension）

正確答案：A. 鬱血性心臟衰竭